Clinical trial exclusion criterion:
Subject receiving dopamine agonists, nitrates, alpha-receptor blocking agents, or antihypertensive medication (see other exclusionary medications listed below)

Annotated entities:
- Drug: "dopamine agonists"
- Drug: "nitrates"
- Drug: "alpha-receptor blocking agents"
- Drug: "antihypertensive medication"